Bilirubin/ SGOT/SGPT < 5 × upper normal limits.

The above is a clinical trial inclusion criterion. Annotated with entity spans:
[Measurement: Bilirubin]/ [Measurement: SGOT]/[Measurement: SGPT] [Value: < 5 × upper normal limits].